有關一位懷疑腰椎椎間盤突出（disc herniation）的 40 歲男性病患之敘述，下列何者錯誤？
A. 可藥物保守治療 2 星期，但須注意括約肌異常及肢體無力之徵兆
B. 其主述可能是下背痛，合併臀、大腿及小腿後外側疼痛，理學檢查 Lasègue's sign 表現十分明顯
C. 腰椎椎間盤突出（disc herniation）90%發生在 L5-S1 或 L4-5 level
D. 腰椎 MRI 影像檢查是最佳檢查項目，plain radiographs 全無診斷價值

正確答案：D. 腰椎 MRI 影像檢查是最佳檢查項目，plain radiographs 全無診斷價值